Treatment of the current flare with Pentasa® to induce a remission initiated by the patient, the general practitioner or the gastroenterologist, during the inclusion visit or during the week before the inclusion visit.

The above is a clinical trial inclusion criterion. Annotated with entity spans:
[Procedure: Treatment] of the current [Condition: flare] with [Drug: Pentasa]® to induce a remission initiated by the patient, the general practitioner or the gastroenterologist, [Temporal: during the inclusion visit] or [Temporal: during the week before the inclusion visit].